Available for all visits scheduled in this study.

The above is a clinical trial inclusion criterion. Annotated with entity spans:
[Observation: Available for all visits] [Qualifier: scheduled in this study].